Clinical trial exclusion criterion:
Abnormal Coagulation (INR>1.5<U+3001>APTT>1.5 UNL), with tendency of bleed;

Entity relations:
- Has_value("INR", ">1.5")
- Has_value("APTT", ">1.5 UNL")
- AND("Abnormal Coagulation", "INR")
- AND("Abnormal Coagulation", "tendency of bleed")
- OR("INR", "APTT")